4. Last (less than 3 months) HbA1c ≤ 10%.

The above is a clinical trial inclusion criterion. Annotated with entity spans:
[Parsing_Error: 4.] [Temporal: Last (less than 3 months)] [Measurement: HbA1c] [Value: ≤ 10%].